一位 30 歲女性因月經不規則來診，病人主訴初經來後即月經不規則，身體檢查發現下腹部中線有細毛，腿毛也增多。下列敘述何者不符此症？
A. 病人常有胰島素抗性
B. 病人雄性素偏高
C. 病人 FSH/LH 比率比正常高
D. 病人卵巢變大

正確答案：C. 病人 FSH/LH 比率比正常高